乳癌手術執行腋下前哨淋巴結摘除（sentinel node biopsy）；前哨淋巴結是指下列何者？
A. 第一群可能轉移的腋下淋巴結（level Ι）
B. 第二群可能轉移的淋巴結（level II）
C. 第一顆可能轉移的腋下淋巴結
D. 第二顆可能轉移的腋下淋巴結

正確答案：C. 第一顆可能轉移的腋下淋巴結